What is  Achondroplasia?

Achondrogenesis type II is an autosomal-dominant disease leading to severe micromelic dwarfism.